關於人類乳突病毒和子宮頸癌的關係，下列敘述何者錯誤？
A. 約 70%子宮頸癌病人之腫瘤內可以驗出第 16 型或第 18 型人類乳突病毒
B. 子宮頸癌最常見的人類乳突病毒為第 18 型
C. 人類乳突病毒透過其 E6 protein、E7 protein 和子宮頸癌上皮細胞之 p53 protein、Rb protein 分別作
D. 人類乳突病毒為環形 DNA 病毒

正確答案：B. 子宮頸癌最常見的人類乳突病毒為第 18 型